Bidimensional measurable disease

The above is a clinical trial inclusion criterion. Annotated with entity spans:
[Non-query-able: Bidimensional measurable disease]